Clinical trial inclusion criterion:
2. Patient with breast cancer, histologically proven, metastatic or locally advanced

Entity relations:
- Has_value("histologically", "proven")
- AND("breast cancer", "histologically")
- OR("histologically", "locally advanced", "metastatic")